Clinical trial exclusion criterion:
Contraindication to peripheral nerve blockade or general anesthesia including:

Entity relations:
- OR("Contraindication to peripheral nerve blockade", "Contraindication to general anesthesia")